下列那一種是陰離子隙增加之代謝性酸中毒（high anion gap metabolic acidosis）？
A. 腹瀉（diarrhea）
B. 飢餓（starvation）
C. 嘔吐（vomitting）
D. 輸尿管－乙形結腸造口術後（ureterosigmoidostomy）

正確答案：B. 飢餓（starvation）